Una mujer de 24 años es encontrada tirada en la calle por unos transeuntes. Al llegar el quipo de emergencias la encontraron con una saturación de oxígeno del 88% respirando aire ambiente y al examen pupilas puntiformes. Se la traslada a la urgencia del hospital más cercano, donde la gasometría arterial basal muestra: pH 7,25, PaCO2 60 mmHg, PaO2 58 mmHg, bicarbonato de 26 mEq/l y exceso de bases de -1. En sangre el sodio es 137 mEq/l y el cloruro 100 mEq/l. Desde el punto de vista gasométrico la paciente tiene:
1. Insuficiencia respiratoria parcial.
2. Acidosis metabólica.
3. Acidosis respiratoria pura.
4. Alcalosis respiratoria por falta de cloro.
5. La gasometría solo puede ser de sangre venosa.

Respuesta correcta: 3. Acidosis respiratoria pura.